關於肛門失禁（anal incontinence）的敘述，下列何者正確？
A. 屬於直腸功能失調（disorders of rectal function），不常發生於婦女
B. 單指表示大便由陰道排出
C. 是指肛門會不自主的（involuntary）排氣或排便
D. 大部分的患者會積極尋求醫治

正確答案：C. 是指肛門會不自主的（involuntary）排氣或排便